Clinical trial exclusion criterion:
Known sensitivity to E. coli derived products

Annotated entities:
- Condition: "sensitivity"
- Qualifier: "E. coli derived"
- Drug: "products"